王先生 62 歲，因解血便而至急診處求診，到院時躺在病床上的心跳是每分鐘 110 下，血壓為 120/60 mmHg，肛門指診檢查發現有紅色血狀物。經過初步的評估及處置，王先生接受鼻胃管置入、沖洗，但未有異常發現。在這過程中王先生又排便出了大量的血便，經輸注了 1500 毫升生理食鹽水靜脈輸液，但是心跳為每分鐘 130 下，血壓為 90/60 mmHg。此時王先生應優先接受下列何種檢查或處置？
A. 胃鏡
B. 腹部電腦斷層攝影
C. 核醫 Technetium-99m RBC scan
D. 腹部血管攝影檢查

正確答案：D. 腹部血管攝影檢查